Clinical trial exclusion criterion:
Exclusion criteria include patients following resuscitation from cardiac arrest who are treated on the cooling protocol

Annotated entities:
- Procedure: "resuscitation from cardiac arrest"
- Qualifier: "cooling protocol"